Presence of organic pathology identified by upper endoscopy or other investigations

The above is a clinical trial exclusion criterion. Annotated with entity spans:
Presence of [Condition: organic pathology] identified by [Procedure: upper endoscopy] or other [Procedure: investigations]